How does condensin affect the function of topoisomeraseII?

Condensin interferes with the function of Topo II. It prevents catenanes from persisting between sister chromatids during mitosis.